長期高血壓、糖尿病、吸菸等均會使血管壁受損，進而引起血管粥狀硬化（atherosclerosis）。這個過程中，血管平滑肌細胞（smooth muscle cells）扮演重要的角色。下列相關敘述何者錯誤？
A. 單核細胞（Monocytes）與血小板（platelets）等血球會在受損的血管內膜細胞聚集
B. 平滑肌細胞受到趨化性物質（chemotactic factors）及促細胞分裂物質（mitogens）的刺激而產生結構性改變，富含更多量的粗型及細型肌纖維蛋白（thick and thin filaments）
C. 異常的平滑肌細胞會移行到血管內膜層（intima）並增生
D. 正常血管壁上之平滑肌呈環狀排列（arranged circumferentially）

正確答案：B. 平滑肌細胞受到趨化性物質（chemotactic factors）及促細胞分裂物質（mitogens）的刺激而產生結構性改變，富含更多量的粗型及細型肌纖維蛋白（thick and thin filaments）